Clinical trial exclusion criterion:
Patients in a critical medical situation.

Annotated entities:
- Condition: "critical medical situation"